Clinical trial exclusion criterion:
known hypersensitivity or contraindication to the study drugs

Annotated entities:
- Condition: "hypersensitivity"
- Condition: "contraindication"
- Drug: "study drugs"